Clinical trial inclusion criterion:
All patients that develop septic shock while in the ICU

Entity relations:
- Has_index("while in the ICU", "in the ICU")
- Has_temporal("septic shock", "while in the ICU")